Subjects completed PEAK can be included if their treatment is the same as randomized even after 30 days of End Of the Study.

The above is a clinical trial inclusion criterion. Annotated with entity spans:
[Post-eligibility: Subjects completed PEAK can be included if their treatment is the same as randomized even after 30 days of End Of the Study].